前臂的骨間前神經（anterior interosseous nerve）為下列何者的分枝？
A. 骨間總神經（common interosseous nerve）
B. 正中神經（median nerve）
C. 尺神經（ulnar nerve）
D. 橈神經（radial nerve）

正確答案：B. 正中神經（median nerve）